Infection at or near the intended needle insertion site

The above is a clinical trial exclusion criterion. Annotated with entity spans:
[Condition: Infection] at or near the [Qualifier: intended needle insertion site]